Patients with hip fractures not requiring surgery (e.g. greater trochanter avulsion) will also be excluded.

The above is a clinical trial exclusion criterion. Annotated with entity spans:
Patients with [Undefined_semantics: hip fractures not requiring surgery] (e.g. [Condition: greater trochanter avulsion]) will also be excluded.